Sobre las modificaciones metabólicas durante el ayuno prolongado, después de 3 a 5 días de ayuno, cuando el organismo entra en un estado de inanición el:
1. Músculo aumenta su utilización de cuerpos cetónicos.
2. Hígado continúa convirtiendo los ácidos grasos en cuerpos cetónicos.
3. Hígado libera glucosa a la sangre a partir de sus depósitos de glucógeno.
4. Cerebro capta los cuerpos cetónicos y los reduce para obtener energía.

Respuesta correcta: 2. Hígado continúa convirtiendo los ácidos grasos en cuerpos cetónicos.